La dinámica demográfica de una comunidad viene determinada por la:
1. Natalidad.
2. Mortalidad.
3. Inmigración.
4. Emigración.
5. Todas son correctas.

Respuesta correcta: 5. Todas son correctas.